Clinical trial exclusion criterion:
History of myocardial infarction within 6 months prior to randomization.

Annotated entities:
- Condition: "myocardial infarction"
- Temporal: "within 6 months prior to randomization"
- Reference_point: "randomization"